下列何者為神經纖維瘤症（neurofibromatosis）最典型的皮膚特徵？
A. linear hypopigmentation
B. cherry red spots
C. port-wine stain
D. café-au-lait spots

正確答案：D. café-au-lait spots